Postmenopausal women with postmenopausal defined as permanent cessation >1 year of previously occurring menses.

The above is a clinical trial inclusion criterion. Annotated with entity spans:
[Pregnancy_considerations: Postmenopausal women with postmenopausal defined as permanent cessation >1 year of previously occurring menses.]